Clinical trial exclusion criterion:
Patients with bone metastases as the only site(s) of measurable disease

Entity relations:
- AND("only site(s) of measurable disease", "bone metastases")